Clinical trial exclusion criterion:
Any clinically significant acute or chronic medical condition requiring care by a primary care provider (e.g., diabetes, coronary artery disease, rheumatologic illness, malignancy, substance abuse) that, in the opinion of the investigator, would preclude participation

Entity relations:
- OR("diabetes", "coronary artery disease", "rheumatologic illness", "malignancy", "substance abuse")